Paciente de 36 años que acude a urgencias por dolor e hinchazón en la región epifísaria de la tibia derecha. La imagen radiográfica es lítica, excéntrica e insufla la cortical. ¿En qué lesión tumoral habrá que pensar como más probable?
1. Osteosarcoma.
2. Tumor de células gigantes.
3. Encondroma.
4. Osteoma osteoide.
5. Condrosarcoma.

Respuesta correcta: 2. Tumor de células gigantes.